Clinical trial inclusion criterion:
1. Age: 18-75 years old, no limitation in gender;

Annotated entities:
- Value: "18-75 years"
- Person: "Age"